以血壓計測得血壓為130/90 毫米汞柱（mmHg）。測量時，下列那一狀況可聽到敲擊且間斷的聲音（tapping and intermittent sound）？
A. 扣帶壓（cuff pressure）＞130 mmHg
B. 130 mmHg＞扣帶壓（cuff pressure）＞90 mmHg
C. 90 mmHg＞扣帶壓（cuff pressure）
D. 測量全程都可聽到，只是頻率不同

正確答案：B. 130 mmHg＞扣帶壓（cuff pressure）＞90 mmHg